Clinical trial exclusion criterion:
Research exemption requested

Annotated entities:
- Observation: "Research exemption requested"